Patient has New York Heart Association (NYHA) class III/IV heart failure.

The above is a clinical trial exclusion criterion. Annotated with entity spans:
Patient has [Measurement: New York Heart Association] ([Measurement: NYHA]) [Value: class III/IV] [Condition: heart failure].